Regular menstrual cycles with duration between 24-35 days

The above is a clinical trial inclusion criterion. Annotated with entity spans:
[Condition: Regular menstrual cycles] with [Measurement: duration] [Value: between 24-35 days]